下列關於顱神經病變之敘述，何者錯誤？
A. 類固醇治療有助於貝爾氏顏面神經麻痺（Bell's palsy）
B. 瞳孔反射正常為糖尿病性動眼神經病變的特色
C. 頭部外傷導致複視最常見之顱神經病變為外展神經
D. 三叉神經痛最少侵犯第一分支

正確答案：C. 頭部外傷導致複視最常見之顱神經病變為外展神經